Drug or alcohol dependence within 1 year

The above is a clinical trial exclusion criterion. Annotated with entity spans:
[Condition: Drug] or [Condition: alcohol dependence] [Temporal: within 1 year]